Clinical trial exclusion criterion:
Patients who have undergone major surgery (e.g., intra-thoracic, -abdominal, or -pelvic) </= 4 weeks prior to starting study treatment or who have not recovered from such therapy

Entity relations:
- Subsumes("major surgery", "intra-thoracic")
- Has_index("</= 4 weeks prior to starting study treatment", "starting study treatment")
- Has_value("major surgery", "</= 4 weeks prior to starting study treatment")
- Has_negation("recovered from such therapy", "not")
- OR("intra-thoracic", "intra -abdominal", "intra -pelvic")
- OR("major surgery", "recovered from such therapy")